Clinical trial inclusion criterion:
Estimated life expectancy of more than 3 months

Annotated entities:
- Measurement: "Estimated life expectancy"
- Value: "more than 3 months"